Clinical trial inclusion criteria:
Liver cirrhosis
Age between 18 and 70 years
Esophageal varices with high bleeding risk: more than F2 and red color sign
No previous history of upper gastrointestinal bleeding
No previous history of endoscopic, radiologic, or surgical therapy for varices or ascites
Do not take beta-blocker, ACE inhibitor, or nitrate
Child-Pugh score <12

Annotated entities:
- Condition: "Liver cirrhosis"
- Person: "Age"
- Value: "between 18 and 70 years"
- Condition: "Esophageal varices"
- Observation: "high bleeding risk"
- Measurement: "F2"
- Multiplier: "more than"
- Condition: "red color sign"
- Negation: "No"
- Condition: "upper gastrointestinal bleeding"
- Negation: "No"
- Condition: "varices"
- Condition: "ascites"
- Procedure: "surgical therapy"
- Procedure: "radiologic therapy"
- Procedure: "endoscopic therapy"
- Negation: "Do not"
- Drug: "beta-blocker"
- Drug: "ACE inhibitor"
- Drug: "nitrate"
- Measurement: "Child-Pugh score"
- Value: "<12"